Clinical trial inclusion criterion:
Primary symptom of chest pain

Annotated entities:
- Condition: "chest pain"
- Qualifier: "Primary symptom"